Clinical trial exclusion criterion:
Major surgery in the last 3 months prior to baseline or planned major surgery or cardiac intervention during the study.

Annotated entities:
- Procedure: "Major surgery"
- Temporal: "last 3 months prior to baseline or planned major surgery or cardiac intervention during the study"
- Reference_point: "baseline or planned major surgery or cardiac intervention during the stud"